下列關於妄想症（delusional disorder）的敘述，何者為非？
A. 以妄想症狀而言，持續最少一個月到三個月以上，其存在是相當個人性而非屬於次文化的一部分
B. 較常見的妄想症為被害型及嫉妒型
C. 妄想症病人可能會合併憂鬱症
D. 妄想症的治療是以心理治療為主

正確答案：D. 妄想症的治療是以心理治療為主